Pregnant or lactating women

The above is a clinical trial exclusion criterion. Annotated with entity spans:
[Condition: Pregnant] or [Condition: lactating] [Person: women]